Se realiza un estudio para investigar la asociación existente entre el factor X y la enfermedad Z. Para ello se seleccionan 120 sujetos con la enfermedad y 420 controles (sin la enfermedad) emparejados por edad y sexo. En ambos grupos se encuentra que 20 sujetos estaban expuestos al factor X. ¿Cuál es la razón de ventaja ("Odds Ratio", OR) entre el factor X y la enfermedad Z?
1. OR = 1 (no hay asociación).
2. OR = 2.
3. OR = 4.
4. OR = 6.
5. OR = 8.

Respuesta correcta: 3. OR = 4.